Clinical trial inclusion criterion:
Informed consent to participate in the study (ICF signed)

Annotated entities:
- Post-eligibility: "Informed consent to participate in the study (ICF signed)"